水晶體異位 (ectopic lentis）是下列那種疾病之表徵？
A. 馬凡氏症候群（Marfan syndrome）
B. 早產兒視網膜病變（retinopathy of prematurity）
C. 威爾遜氏症（Wilson's disease）
D. 第一型糖尿病（幼年型糖尿病）

正確答案：A. 馬凡氏症候群（Marfan syndrome）